¿Cuál de los siguientes cambios es el más potente estímulo para la secreción de glucagón?
1. Llenado gástrico.
2. Hiperglucemia.
3. Hipernatremia.
4. Paso del quimo al duodeno.
5. Hipoglucemia.

Respuesta correcta: 5. Hipoglucemia.